Adult patient being referred for clinically indicated positron emission tomography myocardial perfusion imaging at the Centre hospitalier de l'Université de Montréal

The above is a clinical trial inclusion criterion. Annotated with entity spans:
[Person: Adult] patient being referred for [Qualifier: clinically indicated] [Procedure: positron emission tomography myocardial perfusion imaging] at the [Visit: Centre hospitalier de l'Université de Montréal]